Performed intraoperative ablation

The above is a clinical trial exclusion criterion. Annotated with entity spans:
Performed [Procedure: intraoperative ablation]